Clinical trial exclusion criterion:
history of major systemic illness, including uncontrolled hypertension, diabetes, chronic renal insufficiency, autoimmune diseases or malignancies

Annotated entities:
- Condition: "systemic illness"
- Qualifier: "major"
- Condition: "hypertension"
- Qualifier: "uncontrolled"
- Condition: "diabetes"
- Condition: "chronic renal insufficiency,"
- Condition: "autoimmune diseases"
- Condition: "malignancies"